La prevención primaria:
1. Consiste en evitar la aparición o disminuir la probabilidad de padecer una determinada enfermedad.
2. Se ocupa del diagnóstico y tratamiento precoz de la enfermedad.
3. Actúa cuando ya se ha establecido la enfermedad pero intentando retrasar su curso.
4. Está dirigida a identificar pacientes en riesgo de sufrir intervenciones innecesarias, poco éticas e innecesariamente invasivas.
5. Las respuestas correctas son la 2 y la 3.

Respuesta correcta: 1. Consiste en evitar la aparición o disminuir la probabilidad de padecer una determinada enfermedad.